HIV/ AIDS

The above is a clinical trial exclusion criterion. Annotated with entity spans:
[Condition: HIV]/ [Condition: AIDS]